Clinical trial inclusion criterion:
Adequate haematological function:

Annotated entities:
- Parsing_Error: "Adequate haematological function:"